Clinical trial inclusion criterion:
HYPERTENSIVE: history of BP >140/90, 1 or more antihypertensive medications, LV ejection fraction (LVEF) at least 50%, current BP < 160/90

Annotated entities:
- Condition: "HYPERTENSIVE"
- Measurement: "BP"
- Value: ">140/90"
- Temporal: "history"
- Multiplier: "1 or more"
- Drug: "antihypertensive medications"
- Measurement: "LV ejection fraction (LVEF)"
- Value: "at least 50%"
- Temporal: "current"
- Measurement: "BP"
- Value: "< 160/90"